Clinical trial inclusion criterion:
submucosal,

Annotated entities:
- Condition: "submucosal"